Clinical trial exclusion criterion:
Hemoglobin <10 g/dL

Entity relations:
- Has_value("Hemoglobin", "<10 g/dL")